Clinical trial exclusion criterion:
Immune suppressive treatment within the previous 6 months

Annotated entities:
- Procedure: "Immune suppressive treatment"
- Temporal: "within the previous 6 months"